Clinical trial inclusion criterion:
Patients who have been on a tumor necrosis factor alpha (TNFa) inhibitor (not more than one) must have experienced an inadequate response to previous or current treatment given at an approved dose for at least 3 months prior to baseline or had been intolerant upon administration of an anti-TNFa agent

Annotated entities:
- Drug: "tumor necrosis factor alpha (TNFa) inhibitor"
- Multiplier: "not more than one"
- Condition: "inadequate response"
- Multiplier: "approved dose"
- Temporal: "for at least 3 months prior to baseline"
- Procedure: "treatment"
- Temporal: "current"
- Temporal: "previous"
- Condition: "intolerant"
- Drug: "anti-TNFa agent"